Patients aged between 40 and 60 years old.

The above is a clinical trial inclusion criterion. Annotated with entity spans:
Patients [Person: aged] [Value: between 40 and 60 years old].